一位 40 歲男性，其身高 178 公分、體重 70 公斤，當其未服用任何影響心跳率的藥物時，若建議其以最大心跳率 60~70%之運動強度來從事運動時，則腕部脈搏每十秒鐘跳動幾次最符合此運動建議？
A. 15
B. 17
C. 19
D. 22

正確答案：C. 19